Has chronic hepatitis B (measured by hepatitis B surface antigen test) or active hepatitis C (measured by hepatitis C virus [HCV] Ab test; if positive, HCV ribonucleic acid [RNA] PCR test will be used to confirm active versus past HCV infection), active syphilis infection, chlamydia, gonorrhea, or trichomonas . Active syphilis documented by serology unless positive serology is due to past treated infection

The above is a clinical trial exclusion criterion. Annotated with entity spans:
Has [Condition: chronic hepatitis B] (measured by [Measurement: hepatitis B surface antigen test]) or [Condition: active hepatitis C] (measured by [Measurement: hepatitis C virus [HCV] Ab test]; if [Value: positive], [Measurement: HCV ribonucleic acid [RNA] PCR test] will be used to confirm active versus past HCV infection), [Qualifier: active] [Condition: syphilis infection], [Condition: chlamydia], [Condition: gonorrhea], or [Condition: trichomonas] . [Qualifier: Active] [Condition: syphilis] documented by [Measurement: serology] [Negation: unless] [Value: positive] [Measurement: serology] is due to past [Condition: treated infection]